Initial radiotherapy field of treatment to encompass greater than or equal to 30% of the esophagus

The above is a clinical trial inclusion criterion. Annotated with entity spans:
[Qualifier: Initial] [Measurement: radiotherapy] field of treatment to encompass [Multiplier: greater than] or [Multiplier: equal to 30%] of the [Qualifier: esophagus]